Clinical trial exclusion criterion:
20. Coexistent serious illnesses that would imply a drop-out before the end of the trial.

Annotated entities:
- Parsing_Error: "20."
- Undefined_semantics: "Coexistent serious illnesses that would imply a drop-out before the end of the trial."